Preoperative measurement of corneal astigmatism indicate the subjects are suitable for multifocal intraocular lenses implantation;

The above is a clinical trial inclusion criterion. Annotated with entity spans:
[Temporal: Preoperative] [Measurement: measurement of corneal astigmatism] indicate the subjects are [Value: suitable] for [Procedure: multifocal intraocular lenses implantation];